下列關於自閉症的診斷標準，何者錯誤？
A. 有明顯的語言發展遲緩
B. 有明顯的社交功能障礙
C. 有明顯的重覆性或固著化行為
D. 症狀通常在 10 歲之後出現

正確答案：D. 症狀通常在 10 歲之後出現